Clinical trial exclusion criteria:
Patient has participated in a combination trial where ruxolitinib was dispensed in combination with another study medication and the patient is still receiving combination therapy.
Pregnant or nursing (lactating) women, where pregnancy is defined as the state of a female after conception and until the termination of gestation, confirmed by a positive hCG laboratory test.
Women of child-bearing potential, defined as all women physiologically capable of becoming pregnant, unless they are using highly effective methods of contraception throughout the study duration inclusive of the 30-day safety follow up.

Annotated entities:
- Competing_trial: "Patient has participated in a combination trial where ruxolitinib was dispensed in combination with another study medication and the patient is still receiving combination therapy"
- Pregnancy_considerations: "Pregnant or nursing (lactating) women, where pregnancy is defined as the state of a female after conception and until the termination of gestation, confirmed by a positive hCG laboratory test."
- Pregnancy_considerations: "Women of child-bearing potential, defined as all women physiologically capable of becoming pregnant, unless they are using highly effective methods of contraception throughout the study duration inclusive of the 30-day safety follow up"